List packages for transcription factor binding sites' (TFBS) analysis available in R/Bioconductor

Neighbourhood Consistent PC (NCPC) algorithms, MMDiff and cosmo.